Clinical trial exclusion criterion:
Fasting glucose greater 150 mg/dL.

Annotated entities:
- Measurement: "Fasting glucose"
- Value: "greater 150 mg/dL"